Clinical trial inclusion criterion:
receive standard neo-adjuvant chemotherapy, adjuvant chemotherapy,and standard surgical treatment

Entity relations:
- OR("standard neo-adjuvant chemotherapy", "adjuvant chemotherapy", "standard surgical treatment")